Clinical trial inclusion criterion:
Life expectancy >12 weeks

Annotated entities:
- Observation: "Life expectancy"
- Value: ">12 weeks"